Currently lactating

The above is a clinical trial exclusion criterion. Annotated with entity spans:
[Pregnancy_considerations: Currently lactating]